Clinical trial inclusion criteria:
Age 18 years or older
Symptomatic or asymptomatic coronary artery disease patients
MLA(minimal luminal area)<4mm2
plaque burden>70%
Lipid-rich plaque on NIRS(Intracoronary Near-Infrared Spectroscopy) (defined as maxLCBI4mm>315)
2 target vulnerable lesions
Eligible for percutaneous coronary intervention with Absorb Bioresorbable Vascular Scaffold or Everolimus Eluting Stent
Willing and able to provide informed written consent
Reference vessel diameter 2.75-4.0
Lesion length = 40

Annotated entities:
- Person: "Age"
- Value: "18 years or older"
- Qualifier: "asymptomatic"
- Condition: "coronary artery disease"
- Qualifier: "Symptomatic"
- Measurement: "MLA"
- Measurement: "minimal luminal area"
- Value: "<4mm2"
- Measurement: "plaque burden"
- Value: ">70%"
- Condition: "Lipid-rich plaque"
- Procedure: "NIRS"
- Procedure: "Intracoronary Near-Infrared Spectroscopy"
- Measurement: "maxLCBI4mm"
- Value: ">315"
- Multiplier: "2"
- Condition: "target vulnerable lesions"
- Mood: "Eligible for"
- Procedure: "percutaneous coronary intervention"
- Device: "Absorb Bioresorbable Vascular Scaffold"
- Device: "Everolimus Eluting Stent"
- Post-eligibility: "Willing and able to provide informed written consent"
- Measurement: "Reference vessel diameter"
- Value: "2.75-4.0"
- Measurement: "Lesion length"
- Value: "= 40"